Clinical trial exclusion criterion:
uncontrolled depression

Entity relations:
- Has_qualifier("depression", "uncontrolled")